Clinical trial exclusion criterion:
Drug abuse.

Annotated entities:
- Condition: "Drug abuse"